55 years of age or older at time of randomization;

The above is a clinical trial inclusion criterion. Annotated with entity spans:
[Value: 55 years] of [Person: age] or older [Temporal: at time of randomization];